Diagnosis of peripartum- or chemotherapy-induced cardiomyopathy within the 12 months.

The above is a clinical trial exclusion criterion. Annotated with entity spans:
Diagnosis of [Qualifier: peripartum-] or [Qualifier: chemotherapy-induced] [Condition: cardiomyopathy] [Temporal: within the 12 months].